Clinical trial inclusion criterion:
2. C5 to T12 spinal cord injury, classified as ISNCSCI grades C and D

Annotated entities:
- Parsing_Error: "2."
- Condition: "spinal cord injury"
- Qualifier: "C5 to T12"
- Measurement: "ISNCSCI"
- Value: "grades C and D"